有關甲狀腺（thyroid gland）與副甲狀腺（parathyroid gland），下列敘述何項錯誤？
A. 嗜氧細胞（oxyphil cell）會分泌副甲狀腺素（parathyroid hormone）
B. 副甲狀腺素（parathyroid hormone）可以增進小腸對鈣質的吸收
C. 甲狀腺球蛋白（thyroglobulin）在濾泡細胞（follicle cells）粗糙性內質網（rER）內合成
D. 甲狀腺濾泡旁細胞可分泌降鈣素（calcitonin）

正確答案：A. 嗜氧細胞（oxyphil cell）會分泌副甲狀腺素（parathyroid hormone）